Serum potassium >5.0 molar equivalent/L

The above is a clinical trial exclusion criterion. Annotated with entity spans:
[Measurement: Serum potassium] [Value: >5.0 molar equivalent/L]